2. Pancreas cancer, either s/p resection and adjuvant chemotherapy or locally advanced pancreas cancer s/p chemotherapy and radiation. Initial chemotherapy or radiation therapy may have been stopped between 2 weeks and 2 months prior to study start, and patients must have recovered from prior treatment related toxicity to grade 1 or less.

The above is a clinical trial inclusion criterion. Annotated with entity spans:
2. [Condition: Pancreas cancer], either [Condition: s/p resection] and [Procedure: adjuvant chemotherapy] or [Qualifier: locally advanced] [Condition: pancreas cancer] [Condition: s/p chemotherapy] and [Procedure: radiation]. Initial [Procedure: chemotherapy] or [Procedure: radiation therapy] [Observation: may have been stopped] [Temporal: between 2 weeks and 2 months prior to study start], and patients must have [Condition: recovered from prior treatment] related toxicity to grade 1 or less.